1. Prior exposure to doxorubicin, PLD or any other anthracycline, motolimod and other TLR agonists, MEDI4736 or checkpoint inhibitors, such as anti-CTLA4 and anti-PD1/anti-PD-L1 antibodies.

The above is a clinical trial exclusion criterion. Annotated with entity spans:
[Parsing_Error: 1.] [Temporal: Prior] exposure to [Drug: doxorubicin], [Drug: PLD] or any other [Drug: anthracycline], [Drug: motolimod] and other [Drug: TLR agonists], [Drug: MEDI4736] or [Drug: checkpoint inhibitors], such as [Drug: anti-CTLA4] [Grammar_Error: and] [Drug: anti-PD1]/[Drug: anti-PD-L1 antibodies].